下列有關雀斑（freckle, ephelides）之敘述，何者錯誤？
A. 自幼兒時即發生
B. 在臉上的淡褐色小斑點
C. 斑點的多少不因陽光之照射量而有所改變
D. 斑點之皮膚黑色素細胞不會增多

正確答案：C. 斑點的多少不因陽光之照射量而有所改變